重建手術時，小血管的吻合（anastomosis）最常使用的方式是：
A. 末端與末端吻合（end-to-end anastomosis）
B. 末端與側面的吻合（end-to-side anastomosis）
C. 末端與靜脈移植段（vein graft）之間的吻合
D. 末端與動脈移植段（arterial graft）之間的吻合

正確答案：A. 末端與末端吻合（end-to-end anastomosis）